Clinical trial exclusion criterion:
Acute angle closure glaucoma is suspected

Entity relations:
- Has_mood("Acute angle closure glaucoma", "suspected")